What does temsirolimus inhibit?

Temsirolimus is a mTOR inhibitor